Clinical trial inclusion criterion:
2. Males and females age ≥60 years in first relapse or refractory.

Entity relations:
- Has_value("age", "≥60 years")
- Has_multiplier("relapse", "first")
- OR("relapse", "refractory")